Clinical trial exclusion criterion:
The American Society of Anesthesiologists (ASA) score > 3

Annotated entities:
- Measurement: "American Society of Anesthesiologists (ASA) score"
- Value: "> 3"